有關於 Zollinger-Ellison Syndrome 的敘述，下列何項有誤？
A. 屢發性的嚴重消化性潰瘍
B. 常伴有腹瀉
C. 併有 MEN II syndrome 的症狀
D. 胃泌素（Gastrin）值很高

正確答案：C. 併有 MEN II syndrome 的症狀